Minimum MADRS score = 15.

The above is a clinical trial inclusion criterion. Annotated with entity spans:
[Value: Minimum] [Measurement: MADRS score] = 15.